Clinical trial exclusion criterion:
use of drugs that affect respiratory center drive

Annotated entities:
- Non-query-able: "use of drugs that affect respiratory center drive"